Clinical trial exclusion criterion:
history of allergic disease likely to be stimulated by the vaccination

Annotated entities:
- Condition: "allergic disease"
- Qualifier: "stimulated by the vaccination"
- Procedure: "vaccination"